What is considered a reliable technique for the definitive cytogenetic diagnosis of Fanconi anemia homozygosity?

In vitro enhancement of chromosome breakage by diepoxybutane (DEB) and mitomycin C (MMC) are reliable techniques for the definitive cytogenetic diagnosis of Fanconi anemia homozygosity.